Clinical trial exclusion criterion:
Known pregnancy or breast-feeding.

Entity relations:
- OR("pregnancy", "breast-feeding")